在早產兒中，最常見的腦性麻痺類型為：
A. 一側肢體麻痺（hemiplegia），上肢較嚴重
B. 一側肢體麻痺（hemiplegia），下肢較嚴重
C. 雙側肢體麻痺（diplegia），上肢較嚴重
D. 雙側肢體麻痺（diplegia），下肢較嚴重

正確答案：D. 雙側肢體麻痺（diplegia），下肢較嚴重